Please list the syndromes that are part of Castleman's disease AKA TAFRO

TAFRO syndrome (thrombocytopenia, anasarca, myelofibrosis, renal dysfunction, and organomegaly).